Clinical trial exclusion criterion:
Prior spontaneous preterm birth or second trimester losses between 16(0) and 36(6) weeks

Annotated entities:
- Temporal: "Prior"
- Condition: "spontaneous preterm birth"
- Condition: "losses"
- Qualifier: "between 16(0) and 36(6) weeks"
- Qualifier: "second trimester"